not pregnancy or breastfeeding

The above is a clinical trial inclusion criterion. Annotated with entity spans:
[Negation: not] [Condition: pregnancy] or [Observation: breastfeeding]